Clinical trial inclusion criterion:
Venous incompetence confirmed by clinical assessment and duplex ultrasound scan

Annotated entities:
- Condition: "Venous incompetence"
- Procedure: "clinical assessment"
- Procedure: "duplex ultrasound scan"